一位 43 歲因家暴而剛離婚的婦女，連續一個月的時間，有情緒沮喪、缺乏動機及興趣、疲累、胃口變差、失眠、體重減輕、負面思考等症狀。此病患之臨床診斷最有可能為下列何者？
A. 經前不悅症（premenstrual dysphoric disorder）
B. 強迫症（obsessive compulsive disorder）
C. 重度憂鬱症（major depressive disorder）
D. 恐慌症（panic disorder）

正確答案：C. 重度憂鬱症（major depressive disorder）